La alteración del proceso de lectura en la que se ve afectado el reconocimiento global de las palabras, quedando preservada la capacidad para reconocer las letras de las palabras, se denomina:
1. Dislexia directa.
2. Dislexia fonológica.
3. Dislexia superficial.
4. Alexia pura.
5. Alexia anómica.

Respuesta correcta: 3. Dislexia superficial.